Where is the yeast transpozable element Ty3 preferentially inserted?

Ty3 is preferentially inserted in genes encoding transfer RNA genes.